Clinical trial exclusion criteria:
IIEF < 21
Operations in the past 6 months which could limit the erectile function
Erectile dysfunction in the history or current medication for erectile dysfunction
Current involvement in another comparable study.

Annotated entities:
- Measurement: "IIEF"
- Value: "< 21"
- Temporal: "in the past 6 months"
- Procedure: "Operations"
- Condition: "limit the erectile function"
- Condition: "Erectile dysfunction"
- Temporal: "history"
- Drug: "medication"
- Temporal: "current"
- Condition: "erectile dysfunction"
- Competing_trial: "Current involvement in another comparable study."